For the constructions of which organs has 3D printing been tested?

Nose, ear and meniscus prototypes/constructs have been produced with 3D (3-dimesional) printing.